Except for serious complications (cardiovascular events and recent significant liver, kidney or lung disease within 3 months)

The above is a clinical trial exclusion criterion. Annotated with entity spans:
Except for [Condition: serious complications] ([Condition: cardiovascular events] and recent [Qualifier: significant] liver, kidney or [Condition: lung disease] [Temporal: within 3 months])